Which trancription factor activates the betalain pathway?

The beet Y locus encodes an anthocyanin MYB-like protein that activates the betalain red pigment pathway.